1. Ages 50-95 years

The above is a clinical trial inclusion criterion. Annotated with entity spans:
1. [Person: Ages] [Value: 50-95 years]